Clinical trial inclusion criterion:
able to understand the study and the NRS scale

Annotated entities:
- Observation: "able to understand the study"
- Non-representable: "and the NRS scale"